Patient is hemodynamically stable, hemoglobin >10 mg/dL

The above is a clinical trial inclusion criterion. Annotated with entity spans:
Patient is [Condition: hemodynamically stable], [Measurement: hemoglobin] [Value: >10 mg/dL]